Acude al centro integral de atención al drogodependiente una mujer de 32 años embarazada de 16 semanas, consumidora habitual de cocaína y heroína con antecedentes de fracasos en desintoxicación ambulatoria. No tiene apoyo familiar y manifiesta querer dejar de consumir drogas, pero necesita apoyo para hacerlo. ¿Qué recurso estaría indicado?
1. Unidad hospitalaria de desintoxicación.
2. Comunidades terapéuticas.
3. Centros de día.
4. Pisos de reinserción.
5. Todas las respuestas anteriores son correctas.

Respuesta correcta: 1. Unidad hospitalaria de desintoxicación.